Clinical trial inclusion criterion:
Patients undergoing elective abdominal surgery with an expected blood loss of = 500 ml

Annotated entities:
- Qualifier: "elective"
- Procedure: "abdominal surgery"
- Measurement: "expected blood loss"
- Value: "= 500 ml"